What cellular process is JAK/STAT involved in?

JAK/STAT is involved in the regulation of immunity